Understand and communicate with the investigator, comply with the requirements of the study and give a written, signed and dated informed consent

The above is a clinical trial inclusion criterion. Annotated with entity spans:
[Informed_consent: Understand and communicate with the investigator, comply with the requirements of the study and give a written, signed and dated informed consent]